La medicación antipsicótica para un primer episodio de psicosis después de la primera recuperación de los síntomas debería mantenerse durante un mínimo de:
1. Un año.
2. Dos años.
3. Cuatro años.
4. Indefinidamente.

Respuesta correcta: 2. Dos años.